20歲年輕女性，左乳外側觸摸到一粒1 公分×1公分，表面平滑可移動之乳房腫瘤，最適合的診斷工具為何？
A. 胸部X光攝影
B. 乳房X光攝影
C. 乳房超音波
D. 全身麻醉手術切除

正確答案：C. 乳房超音波